The control group will be matched by the following parameters: age, skin color and type, and indication for peeling, and will be picked up by the dermatologist.

The above is a clinical trial inclusion criterion. Annotated with entity spans:
The [Observation: control group] will be matched by the following parameters: [Person: age], [Person: skin color] and [Person: type], and indication for peeling, and will be picked up by the dermatologist.